Clinical trial exclusion criterion:
For colorectal cancer patients in the expanded cohorts, prior treatment with more than 2 systemic chemotherapy regimens in the metastatic setting

Entity relations:
- AND("more than 2", "systemic chemotherapy regimens")
- Subsumes("systemic chemotherapy regimens", "treatment")
- Has_temporal("systemic chemotherapy regimens", "prior")
- Has_qualifier("systemic chemotherapy regimens", "metastatic")
- AND("colorectal cancer", "systemic chemotherapy regimens")